Un cariotipo 45,XX,rob(15;21)(q10;q10) puede corresponder a:
1. Una niña con Síndrome de Down con una translocación robertsoniana.
2. Una niña con Síndrome de Angelman.
3. Una mujer sana portadora de una translocación robertsoniana.
4. Una mujer sana con Síndrome de Turner.
5. Un varón sano portador de una translocación robertsoniana.

Respuesta correcta: 3. Una mujer sana portadora de una translocación robertsoniana.